Extensive local necrosis or blebs

The above is a clinical trial exclusion criterion. Annotated with entity spans:
[Condition: Extensive local necrosis] or blebs